At least 4 weeks since last surgery or radiation therapy.

The above is a clinical trial inclusion criterion. Annotated with entity spans:
[Temporal: At least 4 weeks since last surgery or radiation therapy].